Clinical trial inclusion criterion:
3. Steroids less than 0.5 mg/kg/day prednisone

Annotated entities:
- Parsing_Error: "3."
- Drug: "Steroids"
- Multiplier: "less than 0.5 mg/kg/day"
- Drug: "prednisone"